Stage 4 or 5 chronic kidney disease (eGFR< 30ml/min/1.73m2),

The above is a clinical trial exclusion criterion. Annotated with entity spans:
[Qualifier: Stage 4 or 5] [Condition: chronic kidney disease] ([Measurement: eGFR][Value: < 30ml/min/1.73m2]),